Subject with clinically significant chronic hematological disease which could lead to priapism such as sickle cell anemia, multiple myeloma, and leukemia

The above is a clinical trial exclusion criterion. Annotated with entity spans:
Subject with [Qualifier: clinically significant] [Qualifier: chronic] [Condition: hematological disease] which [Qualifier: could lead to priapism] such as [Condition: sickle cell anemia], [Condition: multiple myeloma], and [Condition: leukemia]